精子成型過程（spermiogenesis）是指下列何項？
A. 由精母細胞（spermatogonia）轉換為初級精母細胞（primary spermatocytes）
B. 精原細胞脫離塞托利氏細胞（Sertoli cell）
C. 精子在副睪（epididymis）內轉換為具有受精能力之精子（spermatozoa）
D. 由精細胞（spermatid）轉換為成熟之精子（spermatozoa）

正確答案：D. 由精細胞（spermatid）轉換為成熟之精子（spermatozoa）